Clinical trial exclusion criterion:
Diabetes Mellitus

Annotated entities:
- Condition: "Diabetes Mellitus"